Los haluros alcalinos, MX:
1. Son sólidos que funden por debajo de los 100ºC.
2. Forman cristales de colores intensos.
3. Se pueden obtener por reacción de los carbonatos M2CO3 con las disoluciones acuosas de los halogenuros de hidrógeno HX.
4. Ninguno de ellos se puede encontrar en la naturaleza.
5. Son líquidos a temperatura ambiente.

Respuesta correcta: 3. Se pueden obtener por reacción de los carbonatos M2CO3 con las disoluciones acuosas de los halogenuros de hidrógeno HX.